Clinical trial inclusion criterion:
marked disability owing to primary generalized or segmental dystonia, despite optimal pharmacologic treatment

Annotated entities:
- Condition: "disability"
- Condition: "dystonia"
- Qualifier: "segmental"
- Qualifier: "generalized"
- Qualifier: "primary"
- Qualifier: "optimal"
- Procedure: "pharmacologic treatment"